Clinical trial exclusion criterion:
not noticed as bipolar disorder

Annotated entities:
- Negation: "not"
- Mood: "noticed"
- Condition: "bipolar disorder"